Clinical trial exclusion criterion:
abnormal renal function

Annotated entities:
- Condition: "abnormal renal function"